What is the function of the ISW1 and CHD1 remodellers in yeast chromatin?

The ISW1 and CHD1 ATP-dependent chromatin remodelers compete to set nucleosome spacing in vivo